70歲男性右乳暈下發現腫塊、疼痛，下列何項檢查最不需要？
A. 胸部X光
B. 乳房超音波
C. 男性荷爾蒙檢
D. 細針抽取細胞檢查

正確答案：A. 胸部X光